Un paciente de 64 años de edad, agricultor, exfumador (5 años), EPOC y afecto de artritis reumatoide en tratamiento corticoideo. Consulta en urgencias por presentar cefalea intensa de 2 días de evolución con desviación de comisura bucal. Como antecedente, relata que tras cuadro gripal hace un mes, persiste tos, expectoración purulenta y ocasionalmente hemoptoica, febrícula, anorexia, astenia y pérdida de peso. A su llegada se aprecia la existencia de fiebre de 38.2ºC, abscesos cutáneos múltiples en manos, espalda y nalgas (algunos con trayectos fistulosos) y parálisis facial central derecha, infiltrados apicales con pequeño derrame pleural asociado en la radiografía de tórax y leucocitosis con neutrofilia. Entre los siguientes diagnósticos de sospecha consideraría MÁS probable:
1. Neoplasia pulmonar con metástasis cerebrales.
2. Tuberculosis diseminada.
3. Nocardiosis.
4. Aspergilosis.

Respuesta correcta: 3. Nocardiosis.